Clinical trial exclusion criterion:
Primary renal disease

Annotated entities:
- Condition: "Primary renal disease"